Current treatment with prednisone/prednisolone and/or immunosuppressive medication for an indication other than autoimmune hepatitis

The above is a clinical trial exclusion criterion. Annotated with entity spans:
Current treatment with [Drug: prednisone]/[Drug: prednisolone] and/or [Drug: immunosuppressive medication] for an [Condition: indication] [Negation: other] than [Condition: autoimmune hepatitis]